use of pain medication prior to procedure

The above is a clinical trial exclusion criterion. Annotated with entity spans:
use of [Drug: pain medication] [Temporal: prior to procedure]